Clinical trial inclusion criterion:
willing/able to provide informed consent

Annotated entities:
- Informed_consent: "willing/able to provide informed consent"